Is an adapted Avaira sphere contact lens wearer (at least 1 week in Avaira sphere)

The above is a clinical trial inclusion criterion. Annotated with entity spans:
Is an adapted [Device: Avaira sphere contact lens] wearer ([Temporal: at least 1 week in Avaira sphere])